presence of significant scarring in the pelvic area from previous surgery.

The above is a clinical trial exclusion criterion. Annotated with entity spans:
presence of [Condition: significant scarring] in the [Qualifier: pelvic area] [Qualifier: from previous surgery].